有效的醫療告知可以降低下列何項目？
A. 可預見之醫療意外
B. 不可預見之醫療意外
C. 因過失行為造成之醫療糾紛
D. 非因過失行為造成之醫療糾紛

正確答案：D. 非因過失行為造成之醫療糾紛